Clinical trial exclusion criterion:
History of other disease, metabolic dysfunction, physical examination finding, or clinical laboratory finding giving reasonable suspicion of a disease or condition that contraindicates use of an investigational drug or that might affect interpretation of the results of the study or render the patient at high risk for treatment complications

Entity relations:
- Has_qualifier("disease", "other")
- Has_temporal("disease", "History")
- multi("physical examination finding", "physical examination")
- multi("clinical laboratory finding", "clinical laboratory")
- AND("render the patient at high risk", "treatment complications")
- AND("contraindicates", "investigational drug")
- Subsumes("suspicion of", "contraindicates")
- OR("disease", "condition")
- OR("suspicion of", "disease")
- OR("affect interpretation of the results", "render the patient at high risk")